No previous history of endoscopic, radiologic, or surgical therapy for varices or ascites

The above is a clinical trial inclusion criterion. Annotated with entity spans:
[Negation: No] previous history of [Procedure: endoscopic], [Procedure: radiologic], or [Procedure: surgical therapy] for [Condition: varices] or [Condition: ascites]